Clinical trial exclusion criterion:
NA

Annotated entities:
- Not_a_criteria: "NA"